下列有關尿道下裂之敘述，何者錯誤？
A. 尿道開口近膀胱端者比近尿道口者容易矯正
B. 手術矯正前給予雄性荷爾蒙製劑，可能有助於手術的進行
C. 在青春期前短暫給予睪固酮不會影響未來陰莖的發育
D. 7～9%會合併隱睪症，9～16%會合併腹股溝疝氣或陰囊積水

正確答案：A. 尿道開口近膀胱端者比近尿道口者容易矯正